一名 6 歲男童因痙攣而就診，實驗室檢查結果顯示血清鈣離子濃度 6 mg/dL（1.5 mmol/L），無機磷濃度 10 mg/dL，鎂離子濃度 2.4 mg/dL（1.0 mmol/L），完整的副甲狀腺素（intact parathyroid hormone）濃度 180 pg/mL，此患童最可能的診斷為：
A. 鎂缺乏（magnesium deficiency）
B. 副甲狀腺高能症（hyperparathyroidism）
C. 副甲狀腺低能症（hypoparathyroidism）
D. 偽副甲狀腺低能症（pseudohypoparathyroidism）

正確答案：D. 偽副甲狀腺低能症（pseudohypoparathyroidism）